Clinical trial inclusion criterion:
American Society of Anesthesiologists Physical Status (ASA PS) score of I or II.

Entity relations:
- Subsumes("American Society of Anesthesiologists Physical Status score", "ASA PS")
- Has_value("American Society of Anesthesiologists Physical Status score", "I or II")